關於原發性硬化性膽管炎（primary sclerosing cholangitis），下列敘述何者錯誤？
A. 肝內及肝外膽管會有閉塞性纖維化（obliterative fibrosis）和節段性擴張（segmental dilatation）
B. 與HLA-B8相關
C. 常伴隨炎症性腸病（inflammatory bowel disease）
D. 發生於女性較男性多，會出現疲勞，搔癢和黃疸

正確答案：D. 發生於女性較男性多，會出現疲勞，搔癢和黃疸